Clinical trial inclusion criterion:
Can be previously treated with Depo-Lupron, Depo-Provera, or Oral Contraceptive pills

Annotated entities:
- Drug: "Depo-Lupron"
- Drug: "Depo-Provera"
- Drug: "Oral Contraceptive pills"
- Procedure: "treated"
- Temporal: "previously"